Severely impaired hepatic function

The above is a clinical trial inclusion criterion. Annotated with entity spans:
[Qualifier: Severely] [Condition: impaired hepatic function]